Concomitant medication that would interfere with study participation

The above is a clinical trial exclusion criterion. Annotated with entity spans:
[Context_Error: Concomitant medication that would interfere with study participation]